previous intubation or apnea history

The above is a clinical trial exclusion criterion. Annotated with entity spans:
[Temporal: previous] [Procedure: intubation] or [Condition: apnea] [Temporal: history]